El virus de la rubeola es un:
1. Togavirus.
2. Flavivirus.
3. Arenavirus.
4. Ortomixovirus.

Respuesta correcta: 1. Togavirus.